How are immediate early genes (IEG) defined?

this class of genes is experimentally defined by their transcription following primary infection or reactivation in the presence of inhibitors of protein synthesis.